下列何者不是面對舉發「不當研究行為」應採取的作為？
A. 研究者必須對自己的行為負責，要正視不當行為的嚴重性，而且對於其他研究人員的明顯不當研究行為要勇於檢舉
B. 不當研究行為的指控不得在尚未經完整調查與確認前公諸於世
C. 研究機構和研究人員絕對不可以對基於善意而舉發不當研究行為之人，採取任何報復或懲處
D. 研究者有義務在第三公正者的主持下與舉發者進行面對面的辯證

正確答案：D. 研究者有義務在第三公正者的主持下與舉發者進行面對面的辯證